下列關於氣管插管之敘述何者正確？
A. 使用槓桿原理以節省力氣
B. 插管前可以不用準備抽吸管（suction）
C. 喉鏡（laryngoscope）使用時應由中間偏右進入病人口腔，並將舌頭撥往左側
D. 病人躁動時，儘量不要使用快速插管步驟（rapid sequence intubation）

正確答案：C. 喉鏡（laryngoscope）使用時應由中間偏右進入病人口腔，並將舌頭撥往左側